Clinical trial exclusion criterion:
Serious adverse reaction to any vaccination, as respiratory difficulty, angioedema and anaphylaxis;

Annotated entities:
- Condition: "adverse reaction"
- Condition: "respiratory difficulty"
- Procedure: "vaccination"
- Condition: "angioedema"
- Condition: "anaphylaxis"